pregnancy,

The above is a clinical trial exclusion criterion. Annotated with entity spans:
[Condition: pregnancy],